Regular cigarette smoker

The above is a clinical trial exclusion criterion. Annotated with entity spans:
[Observation: Regular cigarette smoker]